Use of oral, injected or implanted hormonal methods of contraception or other forms of hormonal contraception that have comparable efficacy (failure rate <1%), for example hormone vaginal ring or transdermal hormone contraception

The above is a clinical trial exclusion criterion. Annotated with entity spans:
[Non-query-able: Use of oral, injected or implanted hormonal methods of contraception or other forms of hormonal contraception that have comparable efficacy (failure rate <1%)], for example [Procedure: hormone vaginal ring] or [Procedure: transdermal hormone contraception]